Able to ingest oral diet

The above is a clinical trial inclusion criterion. Annotated with entity spans:
[Condition: Able to ingest oral diet]